¿Cuál es la etiología más frecuente de la estenosis aórtica en el adulto?
1. Reumática.
2. Congénita.
3. Degenerativa o calcificada.
4. Post endocarditis.
5. Isquémica.

Respuesta correcta: 3. Degenerativa o calcificada.